Clinical trial exclusion criterion:
Blood group(ABO)-incompatible transplants.

Annotated entities:
- Qualifier: "Blood group(ABO)-incompatible"
- Procedure: "transplants"